Clinical trial inclusion criterion:
Able to communicate well with the investigator and comply with the requirements of the study.

Annotated entities:
- Observation: "Able to communicate well"
- Observation: "comply with the requirements of the study"